Subjects with exclusion criteria required by local law (e.g. age, breastfeeding)

The above is a clinical trial exclusion criterion. Annotated with entity spans:
[Post-eligibility: Subjects with exclusion criteria required by local law (e.g. age, breastfeeding)]